Endometriosis III-IV stage or adenomyosis

The above is a clinical trial exclusion criterion. Annotated with entity spans:
[Condition: Endometriosis] [Qualifier: III-IV stage] or [Condition: adenomyosis]